下列抗癌藥物中，何者可與細胞中的 DNA 形成烴基化的結合（alkylating）？
A. methotrexate
B. busulfan
C. fluorouracil
D. vinblastine

正確答案：B. busulfan